Clinical trial inclusion criteria:
Patients with a histologically or cytologically proven diagnosis of NSCLC
Unresectable (locally advanced) stage IIIa or IIIb disease
Initial radiotherapy field of treatment to encompass greater than or equal to 30% of the esophagus
Life expectancy greater than or equal to 6 months
Estimated weight loss less than or equal to 10% in the 3 months before study randomization
Measurable disease
18 years of age or older
Eastern Cooperative Oncology Group (ECOG) performance status of 0 - 2
Hemoglobin (hgb) greater than or equal to 10 g/dL without transfusional support or growth factor use in the 4 weeks before study randomization
Absolute neutrophil count (ANC) greater than or equal to 1.5 x 10^9/L without growth factor use in the 2 weeks before study randomization
Platelet count greater than or equal to 100 x 10^9/L
Serum bilirubin less than or equal to 1.5 x institutional upper limit of normal (ULN)
Serum creatinine less than or equal to 2.0 mg/dL (Note: Patients with a serum creatinine greater than or equal to 1.4 and less than or equal to 2.0 mg/dL must demonstrate a 24-hour urinary creatinine clearance greater than or equal to 50 mL/min)
Females of childbearing potential: negative serum or urine pregnancy test
Patient must give written informed consent before participating in any study-specific procedure, randomization, or receiving investigational product.
Patients with reproductive capability must agree to practice adequate contraception methods.

Annotated entities:
- Condition: "NSCLC"
- Qualifier: "cytologically proven"
- Qualifier: "histologically proven"
- Condition: "stage IIIb disease"
- Condition: "stage IIIa disease"
- Qualifier: "Unresectable"
- Qualifier: "locally advanced"
- Qualifier: "esophagus"
- Multiplier: "greater than 30"
- Multiplier: "equal to 30%"
- Measurement: "radiotherapy"
- Qualifier: "Initial"
- Observation: "Life expectancy"
- Value: "equal to 6 months"
- Value: "greater than 6 months"
- Temporal: "3 months before study randomization"
- Reference_point: "study randomization"
- Measurement: "Estimated weight loss"
- Value: "equal to 10%"
- Value: "less than 10%"
- Condition: "Measurable disease"
- Value: "18 years or older"
- Person: "age"
- Measurement: "Eastern Cooperative Oncology Group performance status"
- Measurement: "ECOG"
- Value: "0 - 2"
- Measurement: "Hemoglobin"
- Measurement: "hgb"
- Value: "equal to 10 g/dL"
- Value: "greater than 10 g/dL"
- Temporal: "in the 4 weeks before study randomization"
- Reference_point: "study randomization"
- Negation: "without"
- Observation: "transfusional support"
- Observation: "growth factor use"
- Measurement: "Absolute neutrophil count"
- Measurement: "ANC"
- Value: "equal to 1.5 x 10^9/L"
- Value: "greater than 1.5 x 10^9/L"
- Negation: "without"
- Observation: "growth factor use"
- Temporal: "in the 2 weeks before study randomization"
- Reference_point: "study randomization"
- Measurement: "Platelet count"
- Value: "greater than 100 x 10^9/L"
- Value: "equal to 100 x 10^9/L"
- Measurement: "Serum bilirubin"
- Value: "equal to 1.5 x institutional upper limit of normal (ULN)"
- Value: "less than 1.5 x institutional upper limit of normal (ULN)"
- Measurement: "Serum creatinine"
- Value: "equal to 2.0 mg/dL"
- Value: "less than"
- Value: "2.0 mg/dL"
- Measurement: "serum creatinine"
- Value: "equal to 1.4 mg/dL"
- Value: "greater than 1.4 mg/dL"
- Value: "less than 2.0 mg/dL"
- Value: "equal to 2.0 mg/dL"
- Measurement: "24-hour urinary creatinine clearance"
- Value: "equal to 50 mL/min"
- Value: "greater than 50 mL/min"
- Person: "Females"
- Condition: "childbearing potential"
- Measurement: "urine pregnancy test"
- Measurement: "serum pregnancy test"
- Value: "negative"
- Observation: "informed consent"
- Temporal: "before participating in any study-specific procedure, randomization, or receiving investigational product"
- Reference_point: "participating in any study-specific procedure, randomization, or receiving investigational product"
- Qualifier: "study-specific"
- Procedure: "procedure"
- Procedure: "randomization"
- Drug: "investigational product"
- Qualifier: "adequate"
- Procedure: "contraception methods"
- Condition: "reproductive capability"